Unstable/rapidly progressing renal disease or estimated Glomerular Filtration Rate < 60 mL/min (Cockcroft-Gault formula).

The above is a clinical trial exclusion criterion. Annotated with entity spans:
[Qualifier: Unstable]/[Qualifier: rapidly progressing] [Condition: renal disease] or [Measurement: estimated Glomerular Filtration Rate] [Value: < 60 mL/min] ([Qualifier: Cockcroft-Gault formula]).